Need of lower third molar surgeries

The above is a clinical trial inclusion criterion. Annotated with entity spans:
Need of [Qualifier: lower third molar] [Procedure: surgeries]